High bleeding risk surgeries, e.g., Intra-cranial surgery, Intra-spinal surgery, Retinal surgery

The above is a clinical trial exclusion criterion. Annotated with entity spans:
[Condition: High bleeding risk surgeries], e.g., [Condition: Intra-cranial surgery], [Condition: Intra-spinal surgery], [Condition: Retinal surgery]